patients with a diagnosis of either cervical, thoracic, or lumbar facet or sacroiliac joint pain who have responded to medial branch blocks and are already scheduled for bilateral radiofrequency ablations

The above is a clinical trial inclusion criterion. Annotated with entity spans:
patients with a diagnosis of either [Condition: cervical], [Condition: thoracic], or [Condition: lumbar facet] or [Condition: sacroiliac joint pain] who have [Observation: responded] to [Procedure: medial branch blocks] and are already [Mood: scheduled for] [Procedure: bilateral radiofrequency ablations]